contraindications from manufacturer for medications including currently taking haloperidol, artane, Phenergan (Promethazine), chlorpromazine, erythromycin, Azithromycin, clarithromycin, Ketoconazole, fluconazole, mefloquine (as prophylaxis), lumefantrine (in Coartem), quinine, Septrin

The above is a clinical trial exclusion criterion. Annotated with entity spans:
[Condition: contraindications] from manufacturer for medications including currently taking [Drug: haloperidol], [Drug: artane], [Drug: Phenergan] ([Drug: Promethazine]), [Drug: chlorpromazine], [Drug: erythromycin], [Drug: Azithromycin], [Drug: clarithromycin], [Drug: Ketoconazole], [Drug: fluconazole], [Drug: mefloquine] (as prophylaxis), [Drug: lumefantrine] (in [Drug: Coartem]), [Drug: quinine], [Drug: Septrin]